Evidence of neoplastic diseases of the liver

The above is a clinical trial exclusion criterion. Annotated with entity spans:
Evidence of [Condition: neoplastic diseases] of the [Qualifier: liver]